Clinical trial inclusion criterion:
Subject is willing and able to comply with all aspects of treatment and evaluation schedule.

Annotated entities:
- Non-query-able: "Subject is willing and able to comply with all aspects of treatment and evaluation schedule."